Clinical trial exclusion criterion:
Metabolic or hormonal abnormalities.

Annotated entities:
- Condition: "Metabolic abnormalities"
- Condition: "hormonal abnormalities"